Suffering from a movement disorder that could mimic or confound the accurate diagnosis of RLS (eg, Tourette's syndrome, tic disorder, periodic limb movement disorder [PLMD], sleep disorders).

The above is a clinical trial exclusion criterion. Annotated with entity spans:
Suffering from a [Condition: movement disorder] that could mimic or confound the accurate diagnosis of RLS (eg, [Condition: Tourette's syndrome], [Condition: tic disorder], [Condition: periodic limb movement disorder] [[Condition: PLMD]], [Condition: sleep disorders]).